HIV positive

The above is a clinical trial exclusion criterion. Annotated with entity spans:
[Condition: HIV positive]